Clinical trial inclusion criterion:
Patient must have level of serum testosterone above the lower limit of normal.

Entity relations:
- Has_value("level of serum testosterone", "above the lower limit of normal")